¿Cuál de las siguientes respuestas es correcta respecto a un tRNA?
1. El tRNA tiene un anticodón que reconoce al DNA molde.
2. El aminoácido se le une al extremo 5´.
3. Contiene una cola de poliA en su extremo 3´.
4. Puede contener pseudouridina e inosina.
5. Sirve de gen para algunos virus.

Respuesta correcta: 4. Puede contener pseudouridina e inosina.